Clinical trial inclusion criterion:
Patients receiving once daily dosing of methylprednisolone or prednisone in a dose of 10 mg/day or greater

Entity relations:
- Has_multiplier("methylprednisolone", "once daily")
- Has_multiplier("methylprednisolone", "10 mg/day or greater")
- OR("methylprednisolone", "prednisone")